Clinical trial inclusion criterion:
Participants must have completed 3 cycles of a bortezomib-based induction regimen (as defined by current NCCN guidelines) and have no evidence of disease progression as defined by IMWG criteria.

Entity relations:
- AND("induction regimen", "bortezomib")
- Has_multiplier("induction regimen", "3 cycles")
- Has_qualifier("induction regimen", "NCCN guidelines")
- Has_value("IMWG criteria", "no evidence of disease progression")